Clinical trial inclusion criterion:
Severely impaired hepatic function

Entity relations:
- Has_qualifier("impaired hepatic function", "Severely")